能活化 B 細胞的抗原（antigen），其特性不包括下列那一項？
A. 需有 MHC 分子和抗原參與並和 B 細胞上的 immunoglobulin receptor 相結合
B. 抗原上的 epitope 多為親水性性質
C. 抗原上作為 B 細胞認知的 peptides，其序列可為具不連續性的胺基酸序列
D. 抗原可以是 protein, polysaccharide 或 lipid

正確答案：A. 需有 MHC 分子和抗原參與並和 B 細胞上的 immunoglobulin receptor 相結合